Clinical trial inclusion criterion:
Age 10-55 years

Entity relations:
- Has_value("Age", "10-55 years")